Clinical trial exclusion criteria:
Patients with severe complications or severe infection;
Invasion of central nervous system;
Patients with severe heart disease history, including ventricular tachycardia (VT), atrial fibrillation (AF), heart block, myocardial infarction (MI), congestive heart failure (CHF), coronary heart disease patients needed therapy;
patients with severe allergic constitution, or those who are allergic to or intolerant of drug composition in chemotherapy regimens; with other malignant tumors in the past 5 years;
patients received doxorubicin therapy, total cumulative dose of adriamycin was more than 300 mg/m2, total cumulative dose of epirubicin was more than 450 mg/m2;
Patients participate in other clinical studies;
Other patients who are not suitable for the study.

Annotated entities:
- Condition: "complications"
- Qualifier: "severe"
- Qualifier: "severe"
- Condition: "infection"
- Drug: "Patients"
- Condition: "Invasion"
- Qualifier: "central nervous system"
- Condition: "heart disease"
- Qualifier: "severe"
- Condition: "ventricular tachycardia"
- Condition: "VT"
- Condition: "atrial fibrillation"
- Condition: "AF"
- Condition: "heart block"
- Condition: "myocardial infarction"
- Condition: "MI"
- Condition: "congestive heart failure"
- Condition: "CHF"
- Condition: "coronary heart disease"
- Condition: "allergic"
- Qualifier: "severe"
- Condition: "allergic"
- Condition: "intolerant"
- Procedure: "chemotherapy regimens"
- Qualifier: "other"
- Condition: "malignant tumors"
- Temporal: "past 5 years"
- Drug: "doxorubicin"
- Drug: "adriamycin"
- Multiplier: "more than 300 mg/m2"
- Qualifier: "total cumulative dose"
- Drug: "epirubicin"
- Qualifier: "total cumulative dose"
- Multiplier: "more than 450 mg/m2"
- Competing_trial: "Patients participate in other clinical studies"
- Non-query-able: "Other patients who are not suitable for the study"